下列何者不會抑制男性荷爾蒙（testosterone）之合成（biosynthesis）？
A. Ketoconazole
B. Flutamide
C. Estradiol
D. Leuprolide

正確答案：B. Flutamide